Clinical trial exclusion criteria:
With the history of cognitive disorders
With chronic neurological disorders
Cannot communicate with investigators
Cannot stand general anesthesia

Annotated entities:
- Condition: "cognitive disorders"
- Condition: "chronic neurological disorders"
- Observation: "Cannot communicate"
- Observation: "Cannot stand"
- Procedure: "general anesthesia"